En la cuarta fase del parto uno de los signos de desprendimiento placentario consiste en la observación del descenso espontáneo de la pinza del cordón que asoma por la vulva. ¿Cómo se denomina a este signo?:
1. Signo de Küstner.
2. Signo de Fabre.
3. Signo de Strassman.
4. Signo de Ahlfeld.

Respuesta correcta: 4. Signo de Ahlfeld.